Lack of cooperation in the screening phase

The above is a clinical trial exclusion criterion. Annotated with entity spans:
[Post-eligibility: Lack of cooperation in the screening phase]